Clinical trial exclusion criterion:
Known hypersensitivity or intolerability to prednisolone (or prednisone, or equivalent), TAC, or MMF at a dose of 1.25 g or below per day.

Entity relations:
- Has_multiplier("MMF", "1.25 g or below per day")
- AND("hypersensitivity", "prednisolone")
- OR("hypersensitivity", "intolerability")
- OR("prednisolone", "prednisone", "prednisone equivalent", "TAC", "MMF")